Age: > or = 16 years

The above is a clinical trial inclusion criterion. Annotated with entity spans:
[Person: Age]: [Value: > or = 16 years]